Patients attending for a therapeutic endoscopic procedure e.g. variceal banding, stent insertion, balloon dilatation.

The above is a clinical trial exclusion criterion. Annotated with entity spans:
Patients attending for a [Procedure: therapeutic endoscopic procedure] e.g. [Procedure: variceal banding], [Procedure: stent insertion], [Procedure: balloon dilatation].